對酒精相關疾患的描述，何者錯誤？
A. 酒精戒斷時會心跳變慢
B. 酒精戒斷時會冒
C. 長期使用酒精時會低血鈉
D. 酒精戒斷時會誘發譫妄，是高風險病症

正確答案：A. 酒精戒斷時會心跳變慢